下列有關退化性關節炎（osteoarthritis）之敘述，何者最正確？
A. 常發生在承重關節，如膝、髖關節等
B. 復健治療的目的是矯正變形
C. 首選治療方法是人工關節置換手術
D. 只可慢跑，不可游泳

正確答案：A. 常發生在承重關節，如膝、髖關節等